Current participation in transcranial magnetic stimulation studies

The above is a clinical trial exclusion criterion. Annotated with entity spans:
[Temporal: Current] participation in [Procedure: transcranial magnetic stimulation studies]